下列何者可抑制 TNF-α作用而用來治療風濕性關節炎？
A. Etanercept
B. Allopurinol
C. Sulfinpyrazone
D. Methotrexate

正確答案：A. Etanercept